Negative pregnancy test (blood ß-HCG dosage)

The above is a clinical trial inclusion criterion. Annotated with entity spans:
[Value: Negative] [Measurement: pregnancy test] ([Measurement: blood ß-HCG dosage])